Clinical trial inclusion criterion:
Absence of oral lesions

Entity relations:
- Has_negation("oral lesions", "Absence")